肝癌病人若因肝功能過差而無法手術切除者，可考慮肝臟移植手術，但應符合米蘭規約（Milan criteria），其中不包括：
A. 單一腫瘤且最大徑小於 5 公分
B. 2 至 3 顆腫瘤，且最大徑小於 3 公分
C. 主門脈血管被侵犯
D. 無明顯肝外轉移

正確答案：C. 主門脈血管被侵犯